LVAD on warfarin requiring temporary interruption of anticoagulation for procedures

The above is a clinical trial inclusion criterion. Annotated with entity spans:
[Condition: LVAD] on [Drug: warfarin] [Non-representable: requiring temporary interruption of anticoagulation for procedures]